Clinical trial inclusion criterion:
Treatment with Ticagrelor within 48 hours

Entity relations:
- AND("Treatment", "Ticagrelor")
- Has_temporal("Treatment", "within 48 hours")